Clinical trial exclusion criterion:
Participated in other clinical studies in the last 30 days

Annotated entities:
- Observation: "Participated in other clinical studies"
- Temporal: "the last 30 days"